willingness to receive rescue therapy

The above is a clinical trial inclusion criterion. Annotated with entity spans:
[Mood: willingness] to receive [Procedure: rescue therapy]